Clinical trial inclusion criteria:
Caucasian patients affected by uncomplicated, essential hypertension, not well controlled by concomitant administration of ACE-I or ARBs and diuretics at the maximum dosage.

Annotated entities:
- Person: "Caucasian"
- Condition: "essential hypertension"
- Qualifier: "uncomplicated"
- Drug: "ACE-I"
- Drug: "ARBs"
- Drug: "diuretics"
- Multiplier: "maximum dosage"
- Qualifier: "not well controlled"